Dentro de los carcinomas de cabeza y cuello, ¿qué tipo de tumor se relaciona de forma más evidente con el virus del papiloma humano?
1. Carcinoma epidermoide de laringe.
2. Carcinoma epidermoide de orofaringe.
3. Carcinoma epidermoide de hipofaringe.
4. Adenocarcinoma nasosinusal.
5. Carcinoma indiferenciado de cavum.

Respuesta correcta: 2. Carcinoma epidermoide de orofaringe.